La determinación de mercurio por la técnica de generación de vapor frío se basa en la reducción del mercurio en disolución ácida y el arrastre del mercurio elemental obtenido a la célula de absorción para su análisis por absorción atómica. Los reductores más utilizados son:
1. El SnCl2, para mercurio inorgánico y el Na BH4 tanto para compuestos organomercuriales como para mercurio inorgánico.
2. El citrato, tanto para mercurio inorgánico, como organomercuriales.
3. El glutatión, especialmente adecuado para todas las especies de mercurio.
4. El CaH2, para los organomercuriales y KMnO4 para mercurio inorgánico.
5. El Na2SO3, para todas las especies de mercurio.

Respuesta correcta: 1. El SnCl2, para mercurio inorgánico y el Na BH4 tanto para compuestos organomercuriales como para mercurio inorgánico.